Clinical trial exclusion criterion:
Patients with a clinically significant disease (chronic, recurrent or active).

Entity relations:
- Has_qualifier("disease", "clinically significant")
- Subsumes("clinically significant", "chronic")
- OR("chronic", "active", "recurrent")